Metastatic breast cancer.

The above is a clinical trial exclusion criterion. Annotated with entity spans:
[Qualifier: Metastatic] [Condition: breast cancer].